Congestive heart failure, history of ventricular tachycardia, ventricular fibrillation or multifocal ventricular extrasystoles or QTc prolongation.

The above is a clinical trial exclusion criterion. Annotated with entity spans:
[Condition: Congestive heart failure], [Temporal: history of] [Condition: ventricular tachycardia], [Condition: ventricular fibrillation] or [Condition: multifocal ventricular extrasystoles] or [Condition: QTc prolongation].